we will not include thumbs

The above is a clinical trial exclusion criterion. Annotated with entity spans:
[Non-representable: we will not include thumbs]